Clinical trial inclusion criterion:
Undergoing elective primary, resurfacing arthroplasty, revision, or second stage re-implantation total hip replacement;

Annotated entities:
- Procedure: "total hip replacement"
- Qualifier: "elective"
- Qualifier: "primary"
- Qualifier: "revision"
- Qualifier: "second stage re-implantation"
- Qualifier: "resurfacing arthroplasty"